染色體為 45, X/46, XY 者，性腺容易長腫瘤，但下列何者除外？
A. Gonadoblastoma
B. Teratoma
C. Dysgerminoma
D. Yolk sac tumor

正確答案：B. Teratoma